Clinical trial exclusion criterion:
Patients with clinically unstable cardiac arrhythmias, such as recurrent ventricular tachycardia.

Entity relations:
- Has_multiplier("ventricular tachycardia", "recurrent")
- Has_qualifier("cardiac arrhythmias", "clinically unstable")
- AND("cardiac arrhythmias", "ventricular tachycardia")